any known inborn or acquired coagulation disorders

The above is a clinical trial exclusion criterion. Annotated with entity spans:
any known inborn or acquired [Condition: coagulation disorders]